Clinical trial exclusion criterion:
Having participated in other clinical studies with dosing of investigational agents within 8 weeks prior to trial start or currently enrolled in an investigational study that includes treatment with medicinal agents. Subjects who are participating in observational studies or who are in a follow up period of a trial that included drug therapy may be considered for inclusion.

Annotated entities:
- Observation: "participated in other clinical studies"
- Drug: "investigational agents"
- Temporal: "within 8 weeks prior to trial start"
- Temporal: "currently"
- Observation: "enrolled in an investigational study"
- Reference_point: "trial start"
- Drug: "medicinal agents"
- Non-representable: "Subjects who are participating in observational studies or who are in a follow up period of a trial that included drug therapy may be considered for inclusion."